Availability to undergo treatment and return for follow up visits at specified post-operative intervals

The above is a clinical trial inclusion criterion. Annotated with entity spans:
[Non-query-able: Availability to undergo treatment and return for follow up visits at specified post-operative intervals]